盂肱關節（glenohumeral joint）中連接肱骨大、小結節同時固定肱二頭肌長頭之肌腱的韌帶為何？
A. 上盂肱韌帶（superior glenohumeral ligament）
B. 下盂肱韌帶（inferior glenohumeral ligament）
C. 喙肱韌帶（coracohumeral ligament）
D. 肱骨橫韌帶（transverse humeral ligament）

正確答案：D. 肱骨橫韌帶（transverse humeral ligament）